當胰島素（insulin）作用於細胞後，會直接造成：
A. G protein 的活化
B. insulin receptor 上 serine 的磷酸化
C. insulin receptor 的 autophosphorylation
D. adenylate cyclase 的活化

正確答案：C. insulin receptor 的 autophosphorylation